Clinical trial exclusion criterion:
Known hypersensitivity to pembrolizumab or another mAb.

Annotated entities:
- Condition: "hypersensitivity to pembrolizumab"
- Drug: "pembrolizumab"
- Condition: "hypersensitivity to mAb"
- Drug: "mAb"